Participants having H. pylori related chronic gastritis with/without peptic ulcers who are aged greater than 20 years old and are willing to received eradication therapy.

The above is a clinical trial inclusion criterion. Annotated with entity spans:
Participants having [Qualifier: H. pylori related] [Condition: chronic gastritis] with/without [Condition: peptic ulcers] who are [Person: aged] [Value: greater than 20 years old] and are [Mood: willing to receive]d [Procedure: eradication therapy].